La fase de la meiosis donde los pares de cromosomas homólogos se alinean a lo largo del plano ecuatorial se denomina:
1. Profase I.
2. Metafase II.
3. Profase II.
4. Metafase I.
5. Prometafase I.

Respuesta correcta: 4. Metafase I.